Anti-neutrophil cytoplasmic antibodies 最常出現在那種疾病？
A. Wegener's granulomatosis
B. Behçet's disease
C. Rheumatoid arthritis
D. Sjögren's syndrome

正確答案：A. Wegener's granulomatosis